Clinical trial inclusion criterion:
age =18 and <75 years;

Annotated entities:
- Person: "age"
- Value: "=18 and <75 years"